成人腦部重約佔體重之2～3％，需要永不停止供應養分（每天約150公克葡萄糖和72公升氧氣）。腦部氧氣消耗量占身體之多少百分比（％）？
A. 5
B. 10
C. 15
D. 20

正確答案：D. 20